一位 32 歲女性病人因劇烈腹痛來急診，尿液檢查呈現 β-hCG 陽性反應（positive），高度懷疑是子宮外孕（ectopic pregnancy），下列何者較不可能是此疾病之危險因子？
A. 曾植入子宮內裝置（intrauterine device）
B. 有輸卵管開刀（tubal surgery）的病史
C. 有骨盆腔發炎（pelvic inflammatory disease）的病史
D. 曾接受過腹腔鏡闌尾切除術（laparoscopic appendectomy）

正確答案：D. 曾接受過腹腔鏡闌尾切除術（laparoscopic appendectomy）